下列何種抗生素可增加肝臟代謝速率，而使其他藥物之藥效降低？
A. chloramphenicol
B. erythromycin
C. ketoconazole
D. rifampin

正確答案：D. rifampin